Clinical trial inclusion criterion:
Elevated fasting glucose (=100 mg/dl), or on medication for treating the condition

Entity relations:
- Has_value("fasting glucose", "Elevated")
- Subsumes("Elevated", "=100 mg/dl")
- multi("fasting glucose", "Elevated fasting glucose")
- AND("medication for treating", "Elevated fasting glucose")